Clinical trial inclusion criterion:
Reduced left ventricular ejection fraction (<50%)

Annotated entities:
- Value: "Reduced"
- Measurement: "left ventricular ejection fraction"
- Value: "<50%"